Clinical Diagnosis of PD based on the United Kingdom Brain Bank diagnostic criteria for PD.

The above is a clinical trial inclusion criterion. Annotated with entity spans:
Clinical Diagnosis of [Condition: PD] based on the [Measurement: United Kingdom Brain Bank diagnostic criteria] for PD.